Clinical trial exclusion criteria:
can't understand patient controlled analgesia device refuse trial

Annotated entities:
- Post-eligibility: "can't understand patient controlled analgesia device refuse trial"